下列何種疾病，耳鏡檢查可見Schwartze徵象？
A. 聽神經瘤（acoustic neuroma）
B. 膽固醇肉芽腫（cholesterol granuloma）
C. 膽脂瘤（cholesteatoma）
D. 耳硬化症（otosclerosis）

正確答案：D. 耳硬化症（otosclerosis）